Clinical trial exclusion criterion:
Ocular allergy

Annotated entities:
- Condition: "Ocular allergy"